Strict contraindication or inability to receive enteral medications;

The above is a clinical trial exclusion criterion. Annotated with entity spans:
Strict [Condition: contraindication] or inability to receive [Procedure: enteral medications];